a baseline visual acuity ranging from a letter score of 0 to 70 on the Early Treatment Diabetic Retinopathy Study chart

The above is a clinical trial inclusion criterion. Annotated with entity spans:
a [Temporal: baseline] [Measurement: visual acuity] ranging from a [Value: letter score of 0 to 70] on the [Procedure: Early Treatment Diabetic Retinopathy Study chart]